Clinical trial inclusion criterion:
6. Laboratory parameters for vital functions should be in the normal range. Laboratory abnormalities that are not clinically significant are generally permitted, except for the following laboratory parameters, which must be within the ranges specified, regardless of clinical significance:

Annotated entities:
- Parsing_Error: "6."
- Measurement: "Laboratory parameters for vital functions"
- Undefined_semantics: "Laboratory parameters for vital functions"
- Value: "normal range"